Clinical trial exclusion criterion:
Active proliferative diabetic retinopathy (PDR) in the study eye such as NVE, NVD, vitreous hemorrhage, or neovascular glaucoma.

Entity relations:
- Has_qualifier("Active proliferative diabetic retinopathy (PDR)", "in the study eye")
- Subsumes("Active proliferative diabetic retinopathy (PDR)", "NVE")
- OR("NVE", "NVD", "vitreous hemorrhage", "neovascular glaucoma")